年齡老化不會伴隨下列何種病生理變化？
A. increased body fat
B. increased body water
C. lens opacification
D. impaired glucose homeostasis

正確答案：B. increased body water